La tormenta tiroidea o crisis tirotóxica, es un estado de hipertiroidismo extremo caracterizado por:
1. Elevada prevalencia en pacientes con trastornos endocrinos.
2. Hipertermia, taquicardia, trastornos abdominales y neurológicos, incluso crisis epilépticas, delirio y coma.
3. Hipotermia, bradicardia y letargia.
4. No supone una situación de compromiso vital para el paciente con trastornos del sistema endocrino.
5. Hipertermia, bradicardia, trastornos abdominales y ausencia de sintomatología neurológica.

Respuesta correcta: 2. Hipertermia, taquicardia, trastornos abdominales y neurológicos, incluso crisis epilépticas, delirio y coma.